Clinical trial inclusion criteria:
heart failure NYHA II-IV
previous treatment with diuretics
age>18 years

Annotated entities:
- Condition: "heart failure"
- Measurement: "NYHA"
- Value: "II-IV"
- Procedure: "treatment"
- Temporal: "previous"
- Drug: "diuretics"
- Person: "age"
- Value: ">18 years"